Clinical trial inclusion criterion:
Brain temperature > 38.5°C for more than 30 minutes

Entity relations:
- Has_value("Brain temperature", "> 38.5°C")
- Has_temporal("Brain temperature", "for more than 30 minutes")